Has any clinically significant condition or situation (eg, anatomical malformation that complicates intubation) other than the condition being studied that, in the opinion of the investigator, would interfere with the trial evaluations or optimal participation in the trial.

The above is a clinical trial exclusion criterion. Annotated with entity spans:
Has any [Qualifier: clinically significant] [Condition: condition] or [Observation: situation] (eg, [Qualifier: anatomical malformation] that complicates intubation) [Negation: other than] [Condition: the condition being studied] that, in the opinion of the investigator, would [Observation: interfere with the trial evaluations] or optimal participation in the trial.